La ribonucleasa H hidroliza específicamente:
1. El DNA con apareamiento con DNA de secuencia complementaria.
2. El RNA con apareamiento con DNA de secuencia complementaria.
3. El RNA cebador en la replicación.
4. El RNA sin apareamiento con DNA de secuencia complementaria
5. Ciertos intrones en el proceso de maduración.

Respuesta correcta: 2. El RNA con apareamiento con DNA de secuencia complementaria.